Concomitant treatment with high doses of acetylsalicylic acid (> 500 mg/day) or continuous treatment with non-steroidal anti-inflammatory drugs

The above is a clinical trial exclusion criterion. Annotated with entity spans:
[Temporal: Concomitant] [Procedure: treatment] with [Multiplier: high doses] of [Drug: acetylsalicylic acid] ([Multiplier: > 500 mg/day]) or [Temporal: continuous] [Procedure: treatment] with [Drug: non-steroidal anti-inflammatory drugs]